Clinical trial exclusion criterion:
current use of sedatives or antidepressant.

Annotated entities:
- Drug: "sedatives"
- Temporal: "current"
- Drug: "antidepressant"